Intolerance/allergy to local anesthetics

The above is a clinical trial exclusion criterion. Annotated with entity spans:
[Condition: Intolerance]/[Condition: allergy] to [Drug: local anesthetics]